下列關於肺外結核（extrapulmonary tuberculosis）治療的敘述，何者錯誤？
A. 淋巴腺結核是最常見的肺外結核
B. 脊椎結核（Pott's disease）所併發的脊髓病變（myelopathy）多數能隨	藥物治療而逐漸恢復
C. 結核性心包膜炎（pericarditis）的治療除了抗結核標準治療外，類固醇治療未被確認可改善病情
D. 結核性腦膜炎（meningitis）治療為標準抗結核治療6個月

正確答案：D. 結核性腦膜炎（meningitis）治療為標準抗結核治療6個月